關於非自主體重減輕（involuntary weight loss）之敘述，下列何者錯誤？
A. 一般臨床上有意義之體重減輕，定義為在6～12個月內，體重減輕＞5%
B. 只有第一型糖尿病患控制不佳時，會有體重減輕；第二型糖尿病患控制不佳時仍多肥胖，
C. 病患沒有刻意節食或運動減重
D. 合併有心悸或高血壓時，要考慮甲狀腺機能亢進或嗜鉻細胞瘤

正確答案：B. 只有第一型糖尿病患控制不佳時，會有體重減輕；第二型糖尿病患控制不佳時仍多肥胖，